Clinical trial inclusion criterion:
Patient with record of congenital AAT deficiency of phenotype PiZZ (homozygote) or other rare phenotypes related to AAT deficiency and with AAT serum level ≤ 11 micromole. For patients receiving IV AAT augmentation therapy the serum AAT level threshold does not apply.

Annotated entities:
- Condition: "congenital AAT deficiency of phenotype PiZZ (homozygote)"
- Condition: "rare phenotypes related to AAT deficiency"
- Measurement: "AAT serum level"
- Value: "≤ 11 micromole"
- Procedure: "IV AAT augmentation therapy"
- Context_Error: "For patients receiving IV AAT augmentation therapy the serum AAT level threshold does not apply."